Clinical trial inclusion criterion:
Availability of tumor biopsy material extracted and preserved by the investigating site.

Annotated entities:
- Non-representable: "Availability of tumor biopsy material extracted and preserved by the investigating site"